Clinical trial inclusion criteria:
Age 1-59 months,
Plan to remain in study area greater than 6 months
Discharged from hospital following non-trauma related admission

Annotated entities:
- Person: "Age"
- Value: "1-59 months"
- Temporal: "greater than 6 months"
- Observation: "remain in study area"
- Mood: "Plan"
- Procedure: "Discharged from hospital"
- Procedure: "non-trauma related admission"
- Visit: "hospital"